下列何者為腹膜透析患者發生腹膜炎最常見之病因？
A. 濾過性病毒
B. 黴菌
C. 革蘭氏陰性菌
D. 革蘭氏陽性菌

正確答案：D. 革蘭氏陽性菌